Clinical trial exclusion criterion:
Has an active infection requiring systemic therapy

Annotated entities:
- Condition: "active infection"